Left ventricular ejection fraction > 25%

The above is a clinical trial inclusion criterion. Annotated with entity spans:
[Measurement: Left ventricular ejection fraction] [Value: > 25%]